下列關於腎上腺的敘述何者錯誤？
A. 腎上腺與腎臟都位在腎筋膜（renal fascia）內
B. 左腎上腺呈半月狀
C. 供應腎上腺的動脈可直接源自腹主動脈
D. 左腎上腺靜脈匯入下腔靜脈

正確答案：D. 左腎上腺靜脈匯入下腔靜脈